Clinically relevant findings(e.g. blood pressure, electrocardiogram(ECG); physical and gynecological examination, laboratory examination)

The above is a clinical trial exclusion criterion. Annotated with entity spans:
[Qualifier: Clinically relevant] [Condition: findings](e.g. [Measurement: blood pressure], [Procedure: electrocardiogram(ECG)]; [Procedure: physical] and [Procedure: gynecological examination], [Procedure: laboratory examination])